Clinical trial inclusion criteria:
Patients in the cardiothoracic intensive care after cardiac surgery with cardiopulmonary bypass
Acute kidney injury, defined as increase in S-creatinine 50% or 27 mol/L
Normal S-creatinine before surgery

Annotated entities:
- Visit: "cardiothoracic intensive care"
- Temporal: "after cardiac surgery with cardiopulmonary bypass"
- Procedure: "cardiac surgery"
- Reference_point: "cardiac surgery with cardiopulmonary bypass"
- Procedure: "cardiopulmonary bypass"
- Condition: "Acute kidney injury"
- Measurement: "increase in S-creatinine"
- Value: "50% or 27 mol/L"
- Value: "Normal"
- Measurement: "S-creatinine"
- Temporal: "before surgery"
- Reference_point: "surgery"
- Procedure: "surgery"